Clinical trial exclusion criterion:
25. Body Mass Index (BMI) > 30 kg/m²

Entity relations:
- Has_value("Body Mass Index (BMI)", "> 30 kg/m²")